contraindication to the lumbar puncture

The above is a clinical trial exclusion criterion. Annotated with entity spans:
[Condition: contraindication] to the [Procedure: lumbar puncture]